Hombre de 55 años, obeso, dislipémico y fumador activo. En estudio por hipertensión arterial refractaria sin evidencia de daño cardiaco o renal hasta el momento. Refiere cefalea matutina con hipersomnia diurna. Se realiza MAPA (monitorización ambulatoria de presión arterial 24 horas) y se confirma hipertensión arterial a pesar de 3 fármacos, uno de ellos diurético, objetivándose presiones arteriales nocturnas más elevadas que las diurnas. ¿Qué prueba diagnóstica solicitaría a continuación con su sospecha clínica?
1. Determinación de catecolaminas en orina 24h.
2. Determinación      hormonal     de    renina– aldosterona.
3. Polisomnografía nocturna.
4. Eco doppler renal.
5. TC aorta.

Respuesta correcta: 3. Polisomnografía nocturna.